Body Mass Index (BMI) of > 32

The above is a clinical trial exclusion criterion. Annotated with entity spans:
[Measurement: Body Mass Index] ([Measurement: BMI]) of [Value: > 32]